Clinical trial inclusion criteria:
Type 2 Diabetes Mellitus patients
Patient who had been diagnosed within the previous 12 months with HbA1c levels of 8.0-12.0%, did not have a medical history related to diabetes, and did not display proliferative retinopathy

Annotated entities:
- Condition: "Type 2 Diabetes Mellitus"
- Measurement: "HbA1c"
- Value: "8.0-12.0%"
- Temporal: "previous 12 months"
- Negation: "not"
- Condition: "proliferative retinopathy"
- Negation: "not"
- Temporal: "medical history related to diabetes"